下列何種脂蛋白（lipoprotein）的主要功能是將 cholesterol 運送給周邊組織？
A. chylomicron
B. VLDL
C. LDL
D. HDL

正確答案：C. LDL